Sensitivity to Mebeverine

The above is a clinical trial exclusion criterion. Annotated with entity spans:
[Condition: Sensitivity] to [Drug: Mebeverine]